Los tres cromosomas humanos que se estima contienen menor número de genes son:
1. 21, 22 e Y.
2. 18, 22 e Y.
3. 18, 21 e Y.
4. 13, 21 e Y.
5. 13, 22 e Y.

Respuesta correcta: 3. 18, 21 e Y.